Clinical trial inclusion criterion:
body mass index (BMI) between 19 to 30 kg/m2 and body weight between 50 to 100 kg inclusive

Entity relations:
- Has_value("body weight", "50 to 100 kg inclusive")
- Has_value("body mass index (BMI)", "between 19 to 30 kg/m2")